Mutations in which gene cause Schimke immune-osseous dysplasia?

Mutations in this gene are the cause of Schimke immune-osseous dysplasia , an autosomal recessive disorder characterized by T-cell immunodeficiency and growth dysfunctions. SMARCAL1 , also known as HARP, is an ATP-dependent annealing helicase that stabilizes replication forks during DNA damage.